下列何者比較適合被用來預防或避免因化學治療藥物所引起的嘔吐及噁心的副作用？
A. levodopa
B. misoprostol
C. sucralfate
D. ondansetron

正確答案：D. ondansetron